Clinical trial exclusion criterion:
previous operation of tongue

Entity relations:
- Has_temporal("operation of tongue", "previous")